Clinical trial exclusion criterion:
7. Other serious medical illness likely to interfere with study participation or with the ability to complete the trial by the judgment of the investigator (e.g. unstable psychiatric condition).

Annotated entities:
- Parsing_Error: "7."
- Condition: "Other medical illness"
- Qualifier: "serious"
- Subjective_judgement: "serious"
- Context_Error: "likely to interfere with study participation"
- Context_Error: "likely to interfere with the ability to complete the trial"
- Subjective_judgement: "by the judgment of the investigator"
- Condition: "psychiatric condition"
- Qualifier: "unstable"